Clinical trial inclusion criterion:
Female subjects of non-childbearing potential may be enrolled in the study. Non-childbearing potential is defined as pre-menarche, current bilateral tubal ligation or occlusion, hysterectomy, bilateral ovariectomy or post-menopause.

Entity relations:
- Has_negation("childbearing potential", "non-")
- Has_temporal("bilateral tubal ligation", "current")
- multi("bilateral tubal occlusion", "bilateral tubal occlusion")
- multi("bilateral tubal ligation", "bilateral tubal ligation")
- multi("bilateral ovariectomy", "bilateral ovariectomy")
- Subsumes("childbearing potential", "pre-menarche")
- OR("bilateral tubal ligation", "bilateral tubal occlusion")
- OR("pre-menarche", "bilateral tubal ligation", "hysterectomy", "bilateral ovariectomy", "post-menopause")